Clinical trial inclusion criterion:
No response to more than one antiarrhythmic drug, or unwilling to receive long-term drug treatment.

Annotated entities:
- Drug: "antiarrhythmic drug"
- Condition: "response"
- Negation: "No"
- Multiplier: "more than one"
- Non-query-able: "or unwilling to receive long-term drug treatment."